(1) intrauterine device in place for at least 3 months prior to the start of the study and remaining in place during the study period, or (2) barrier methods containing or used in conjunction with a spermicidal agent, or (3) postmenopausal accompanied with a documented postmenopausal course of at least one year or surgical sterility (tubal ligation, oophorectomy or hysterectomy).

The above is a clinical trial inclusion criterion. Annotated with entity spans:
(1) [Device: intrauterine device] in place [Temporal: for at least 3 months prior to the start of the study] and remaining [Temporal: in place during the study period], or (2) [Procedure: barrier methods] containing or used in conjunction with a [Drug: spermicidal agent], or (3) [Condition: postmenopausal] accompanied with a documented postmenopausal course of [Temporal: at least one year] or [Condition: surgical sterility] ([Procedure: tubal ligation], [Procedure: oophorectomy] or [Procedure: hysterectomy]).